Subject has an active infection either systemic or local.

The above is a clinical trial exclusion criterion. Annotated with entity spans:
Subject has an [Qualifier: active] [Condition: infection] either [Qualifier: systemic] or [Qualifier: local].